Clinical trial exclusion criterion:
chronic cholecystitis

Annotated entities:
- Condition: "chronic cholecystitis"